What is the difference between CRISPR-Cas12a and CRISPR-Cpf1?

CRISPR-Cas12a and CRISPR-Cpf1 refer to the same thing.